En evaluaciones económicas, ¿cuál de los siguientes costes corresponden a costes indirectos no sanitarios?
1. Hospitalización del paciente.
2. Cuidados en casa del paciente.
3. Pérdida de productividad del paciente.
4. Gastos de desplazamiento del paciente.
5. Rehabilitación del paciente.

Respuesta correcta: 3. Pérdida de productividad del paciente.